下列有關抗癲癇藥物 carbamazepine 的描述，何者錯誤？
A. 其口服效果不佳，需以靜脈注射的方式給藥
B. carbamazepine 具有延長鈉離子管道不反應期的作用
C. oxcarbazepine 的作用強度較 carbamazepine 大
D. carbamazepine 會促進肝臟微粒體酵素的活性，因此會增加其他藥物的代謝作用

正確答案：A. 其口服效果不佳，需以靜脈注射的方式給藥